下列有關 Bacteroides fragilis 的敘述，何者錯誤?
A. 20% bile 抑制其生長
B. 可水解 esculin
C. 為革蘭氏陰性菌
D. 有些對 clindamycin 有抗藥性

正確答案：A. 20% bile 抑制其生長